Clinical trial exclusion criterion:
Apparent sensitivity to any of the study peptides as determined by the skin test

Annotated entities:
- Condition: "sensitivity"
- Drug: "study peptides"
- Procedure: "skin test"